Systolic BP more than 160mmHg

The above is a clinical trial exclusion criterion. Annotated with entity spans:
[Measurement: Systolic BP] [Value: more than 160mmHg]